Clinical trial exclusion criterion:
preoperative systolic blood pressure <90 mmHg, or the heart rate <50/min.

Entity relations:
- Has_value("preoperative systolic blood pressure", "<90 mmHg")
- Has_value("heart rate", "<50/min")
- OR("preoperative systolic blood pressure", "heart rate")